Clinical trial exclusion criterion:
Being pregnant or plan on immediately becoming pregnant

Entity relations:
- Has_mood("pregnant", "plan on immediately becoming")
- OR("pregnant", "pregnant")